Cardiac or neurologic active medical condition, including past CVA/TIA (Cardiovascular Accident/Transient Ischemic Attack) or any other unstable medical condition.

The above is a clinical trial exclusion criterion. Annotated with entity spans:
[Condition: Cardiac] or [Condition: neurologic active medical condition], including [Temporal: past] [Condition: CVA]/[Condition: TIA] ([Condition: Cardiovascular Accident]/[Condition: Transient Ischemic Attack]) or any other [Qualifier: unstable] [Condition: medical condition].